Clinical trial exclusion criterion:
Diagnosis of a sleep disorder other than insomnia including PSG findings of apnea/hypopnea or periodic limb movement indices > 10/hour;

Annotated entities:
- Condition: "sleep disorder"
- Negation: "other"
- Condition: "insomnia"
- Condition: "apnea"
- Condition: "hypopnea"
- Measurement: "periodic limb movement indices"
- Value: "> 10/hour"
- Measurement: "PSG"